Clinical trial exclusion criterion:
Receipt of an investigational product (within 30 days before vaccination).

Annotated entities:
- Competing_trial: "Receipt of an investigational product (within 30 days before vaccination)."